在繞過腳內踝的跗骨隧道（tarsal tunnel）處，可以觸摸到下列何者的脈搏？
A. 脛前動脈（anterior tibial artery）
B. 脛後動脈（posterior tibial artery）
C. 足底內側動脈（medial plantar artery）
D. 足底外側動脈（lateral plantar artery）

正確答案：B. 脛後動脈（posterior tibial artery）